Clinical trial inclusion criterion:
Not planned for discharge within 60 hours of study entry

Annotated entities:
- Mood: "planned"
- Procedure: "discharge"
- Temporal: "within 60 hours of study entry"
- Reference_point: "study entry"
- Measurement: "Not"